Clinical trial exclusion criterion:
Others

Annotated entities:
- Non-query-able: "Others"